下列關於扁桃腺的發育，何項正確？
A. 腭扁桃腺源自第二對咽囊
B. 咽扁桃腺源自口咽之淋巴小結
C. 舌扁桃腺源自鼻咽之淋巴小結下降聚集而成
D. 管扁桃腺源自舌根之淋巴小結

正確答案：A. 腭扁桃腺源自第二對咽囊